Clinical trial exclusion criterion:
Diagnosis of ankle fracture or ligament rupture

Entity relations:
- OR("ankle fracture", "ligament rupture")